下列何種姿勢可以最有效地改善中風偏癱病人的吞嚥障礙（dysphagia）？
A. 將頭部前傾、下巴收攏（chin tuck）
B. 將頭部轉向健側邊（turning the head to the stronger side）
C. 將頭部傾向患側邊（tilting the head toward the affected side）
D. 將頭部後仰，下巴前伸（neck extension）

正確答案：A. 將頭部前傾、下巴收攏（chin tuck）